嚼檳榔引起的口腔癌，最常見的組織型是：
A. 鱗狀細胞癌
B. 釉芽細胞瘤
C. 未分化癌
D. 腺癌

正確答案：A. 鱗狀細胞癌